Clinical trial exclusion criterion:
History of any malignancy or other severe diseases

Entity relations:
- OR("malignancy", "severe diseases")